Clinical trial exclusion criterion:
Malignancies or other comorbid conditions with life expectancy less than 12 months or that may result in protocol noncompliance

Annotated entities:
- Condition: "Malignancies"
- Condition: "comorbid conditions"
- Qualifier: "other"
- Observation: "life expectancy"
- Value: "less than 12 months"
- Observation: "protocol noncompliance"
- Mood: "may"